Pregnancy or in breast-feeding

The above is a clinical trial exclusion criterion. Annotated with entity spans:
[Pregnancy_considerations: Pregnancy or in breast-feeding]